下列有關冠狀動脈疾病病人之處置，何者錯誤？
A. 三條冠狀動脈疾病之糖尿病病人接受冠狀動脈繞道手術，比接受支架置放術具有較好的長期存活
B. 多條血管冠狀動脈疾病病人的治療方面，經皮冠狀動脈處置（percutaneous coronary intervention）與冠狀動脈繞道手術皆比藥物治療有顯	的生存利益
C. 高嚴重性冠狀動脈疾病病人若以經皮冠狀動脈處置治療，其再處置率較接受冠狀動脈繞道手術者為高
D. 具有高風險的特徵（例如：糖尿病、左心室功能異常、腎功能異常、年老、慢性肺病、周邊動脈疾病）的多條血管冠狀動脈疾病病人接受冠狀動脈繞道手術比接受經皮冠狀動脈處置具有較差的長期存活率

正確答案：D. 具有高風險的特徵（例如：糖尿病、左心室功能異常、腎功能異常、年老、慢性肺病、周邊動脈疾病）的多條血管冠狀動脈疾病病人接受冠狀動脈繞道手術比接受經皮冠狀動脈處置具有較差的長期存活率